Clinical trial exclusion criterion:
any known inborn or acquired coagulation disorders

Annotated entities:
- Condition: "coagulation disorders"